Presence of any systemic disease that could alter the production or composition of saliva.

The above is a clinical trial exclusion criterion. Annotated with entity spans:
Presence of any [Condition: systemic disease] that [Qualifier: could alter the production or composition of saliva].